Clinical trial inclusion criterion:
Male or female subjects aged =18 to =65 years

Annotated entities:
- Person: "Male"
- Person: "female"
- Person: "aged"
- Value: "=18 to =65 years"